Clinical trial exclusion criterion:
4. HbA1c > 9%

Annotated entities:
- Parsing_Error: "4."
- Measurement: "HbA1c"
- Value: "> 9%"